下列有關孩童的腹部病灶，那一項可以鋇劑檢查治療？
A. 十二指腸閉鎖（duodenal atresia）
B. 迴腸結腸套疊（ileocolic intussusception）
C. 巨結腸病（Hirschsprung's disease）
D. 肛門閉鎖（imperforated anus）

正確答案：B. 迴腸結腸套疊（ileocolic intussusception）